MADRS total score of 18 or higher

The above is a clinical trial inclusion criterion. Annotated with entity spans:
[Measurement: MADRS] total [Value: score of 18 or higher]